Clinical trial inclusion criterion:
The patient is willing and able to complete protocol required baseline assessments and procedures

Annotated entities:
- Observation: "willing and able to complete protocol"
- Procedure: "baseline assessments"
- Procedure: "baseline procedures"